在沒有任何特別合併症的情形下，治療皮肌炎（dermatomyositis）或多發性肌炎（polymyositis）的患者最優先選擇的藥物是：
A. corticosteroid
B. azathioprine
C. cyclophosphamide
D. intravenous immunoglobulin（IVIG）

正確答案：A. corticosteroid